Clinical trial exclusion criterion:
Patients with clinically significant ECG or laboratory abnormalities

Entity relations:
- multi("laboratory abnormalities", "laboratory")
- multi("ECG abnormalities", "ECG")
- Has_qualifier("laboratory abnormalities", "clinically significant")
- Has_qualifier("ECG abnormalities", "clinically significant")